Patients aged 19 or older

The above is a clinical trial inclusion criterion. Annotated with entity spans:
Patients [Person: aged] [Value: 19 or older]